Severe hyperchloraemia

The above is a clinical trial inclusion criterion. Annotated with entity spans:
[Qualifier: Severe] [Condition: hyperchloraemia]